一位70歲女性患者，有高血壓、糖尿病病史多年，晚上11點入睡時皆正常，清晨6點起床時，卻發現說話不太清楚，左側肢體無力，早晨6點30分，被家人送至急診室，早晨7點20 分，血壓：160/88 mmHg，所有血液生化檢查、心電圖皆正常，腦斷層檢查無腦出血或其它異常，此時最不適合的治療為何？
A. 給予靜脈血栓溶解劑（rt-PA）治療
B. 給予口服抗血小板劑（aspirin）治療
C. 住進腦中風加護病房診療
D. 嚴格控制血糖值

正確答案：A. 給予靜脈血栓溶解劑（rt-PA）治療